Having a remote infection,

The above is a clinical trial exclusion criterion. Annotated with entity spans:
Having a [Condition: remote infection],